Lesion length = 40

The above is a clinical trial inclusion criterion. Annotated with entity spans:
[Measurement: Lesion length] [Value: = 40]